一位 56 歲男性，因頸部淋巴結腫大來求診，切片發現為「分泌多量黏液的腺癌轉移」，以下部位中，最有可能的原發病灶為：
A. 小腦
B. 攝護腺
C. 鼻咽部
D. 結腸

正確答案：D. 結腸